Clinical trial exclusion criterion:
Have had a prior catheter ablation procedure for VT

Annotated entities:
- Procedure: "catheter ablation procedure"
- Condition: "VT"